1. Mean pulmonary arterial pressure ≥25 mmHg (at rest) and

The above is a clinical trial inclusion criterion. Annotated with entity spans:
[Parsing_Error: 1.] [Measurement: Mean pulmonary arterial pressure] [Value: ≥25 mmHg] ([Qualifier: at rest]) and